Clinical trial exclusion criterion:
Administration of HES, dextrane solutions or > 500 ml of Gelatin solutions within the 24 h prior to randomization

Entity relations:
- Has_multiplier("Gelatin solutions", "> 500 ml")
- Has_temporal("HES", "within the 24 h prior to randomization")
- OR("HES", "dextrane solutions", "Gelatin solutions")